一位女性病人突然發燒、腹痛、心跳加速、噁心及黃疸。病人脾臟可觸診到脾尖。周邊血液白血球數正常；但病人稍貧血，紅血球也較小且無中心蒼白區，並有顯著網狀紅血球增生（reticulocytosis）。可能誘發此一病情危機之原因為：
A. 服用 Quinacrine 類藥物
B. Parvovirus 感染
C. 血氧分壓降低
D. 暴露冷環境

正確答案：B. Parvovirus 感染